Clinical trial exclusion criterion:
Subjects with a history of small bowel or colonic resection.

Annotated entities:
- Condition: "small bowel resection"
- Condition: "colonic resection"
- Temporal: "history"